Neuromuscular disease

The above is a clinical trial exclusion criterion. Annotated with entity spans:
[Condition: Neuromuscular disease]